下列有關腦部小窩性梗塞（lacunar infarcts）的敘述，何者錯誤？
A. 最常出現於高血壓
B. 最常出現在基底核
C. 不超過15毫米
D. 係播散性血管內凝血（DIC）的結果

正確答案：D. 係播散性血管內凝血（DIC）的結果